Clinical trial exclusion criterion:
A known bleeding diathesis, hemostatic or coagulation disorder, or prior major bleeding

Annotated entities:
- Condition: "bleeding diathesis"
- Condition: "coagulation disorder"
- Condition: "hemostatic disorder"
- Condition: "major bleeding"
- Temporal: "prior"